Clinical trial inclusion criterion:
Age 60 years or older.

Annotated entities:
- Person: "Age"
- Value: "60 years or older"